Subject with a diagnosis of gastroparesis or small bowel or large bowel dysmotility.

The above is a clinical trial exclusion criterion. Annotated with entity spans:
Subject with a diagnosis of [Condition: gastroparesis] or [Condition: small bowel] or [Condition: large bowel dysmotility].